What are the 3 types of immunoglobulin heavy chain containing antibodies found in human breast milk?

IgA, IgG, AND  IgM can be found in human milk.